Informed consent signed.

The above is a clinical trial inclusion criterion. Annotated with entity spans:
[Observation: Informed consent signed].